Clinical trial exclusion criterion:
History of seizures (this criterion does not apply to subjects who have had a single, uncomplicated febrile convulsion in the past) or neurological disease.

Annotated entities:
- Condition: "seizures"
- Temporal: "History"
- Condition: "febrile convulsion"
- Qualifier: "uncomplicated"
- Multiplier: "single"
- Condition: "neurological disease"
- Negation: "does not apply"